Acute illness or active systemic infection or sepsis

The above is a clinical trial exclusion criterion. Annotated with entity spans:
[Non-query-able: Acute illness] or active [Condition: systemic infection] or [Condition: sepsis]